Clinical trial exclusion criterion:
non-English speaking

Entity relations:
- Has_negation("English speaking", "non")